下列有關皰疹相關病毒的敘述，何者正確？
A. 免疫正常的人發生過皮膚性帶狀皰疹（herpes zoster），大於10%會反覆發作
B. 未曾施打水痘（chickenpox）疫苗且未曾感染過水痘者，在接觸水痘病人後有小於40%會被感染
C. 感染性單核細胞增多症（infectious mononucleosis）的最常見症狀是發燒、喉嚨痛、淋巴結腫大
D. 在年輕人，感染性單核細胞增多症的潛伏期為5〜10天

正確答案：C. 感染性單核細胞增多症（infectious mononucleosis）的最常見症狀是發燒、喉嚨痛、淋巴結腫大